How are immediate early genes (IEG) defined?

Immediate-early (IE) genes are the first class of viral genes expressed after primary infection or reactivation. this class of genes is experimentally defined by their transcription following primary infection or reactivation in the presence of inhibitors of protein synthesis.